Clinical trial inclusion criterion:
aged 30 to 85 years;

Entity relations:
- Has_value("aged", "30 to 85 years")